Genera peróxido de hidrógeno en el fagosoma:
1. Mieloperoxidasa.
2. Anhidrasa carbónica.
3. NADPH oxidasa.
4. Citocromo C oxidasa.
5. Superóxido dismutasa.

Respuesta correcta: 5. Superóxido dismutasa.